Clinical trial exclusion criterion:
Patients with recent cerebral hemorrhage.

Annotated entities:
- Temporal: "recent"
- Condition: "cerebral hemorrhage"